What is a potential alternate uses(repositioning) for Primaquine

Primaquine Diphosphate, a known Antimalarial Drug, blocks Vascular Leakage through Junction Stabilization. This is a potential alternate uses.